Señale la respuesta correcta en relación a la posología en la administración de fármacos en niños:
1. El tamaño corporal influye en exclusiva y por tanto debe calcularse la dosis.
2. Existe un estándar de dosis independientemente del peso, para que el procedimiento sea rápido y eficaz.
3. Se debe tener en cuenta para el cálculo de dosis la altura en centímetros.
4. El cálculo del área de superficie corporal, se considera el método más preciso para la administración de la dosis correcta.
5. Algunos fármacos no marcan diferencias entre dosis para adultos y niños.

Respuesta correcta: 4. El cálculo del área de superficie corporal, se considera el método más preciso para la administración de la dosis correcta.